Las moléculas de la familia CD1 (CD1a, CD1b, CD1c, CD1d y CD1e) se expresan en:
1. Todas las células del organismo.
2. Sólo en células dendríticas.
3. Sólo en macrófagos.
4. Sólo en monocitos.
5. Algunos timocitos, en células dendríticas, en monocitos y macrófagos.

Respuesta correcta: 5. Algunos timocitos, en células dendríticas, en monocitos y macrófagos.